Clinical trial exclusion criterion:
allergy to to local anesthetics

Entity relations:
- AND("allergy", "local anesthetics")